Inability to follow the procedures of the study, e.g. due to language problems, psychological disorders, dementia of the study subject

The above is a clinical trial exclusion criterion. Annotated with entity spans:
[Post-eligibility: Inability to follow the procedures of the study, e.g. due to language problems, psychological disorders, dementia of the study subject]